引起蕁麻疹（urticaria）的原因很多，下列敘述何者最正確？
A. 顯影劑引起的過敏是 bradykinin-mediated
B. 消炎止痛劑引起的過敏是 complement-dependent
C. 食物過敏是 IgE-dependent
D. 抗生素引起的過敏是 immune complex-mediated

正確答案：C. 食物過敏是 IgE-dependent